Patients not willing to adhere to study procedures/treatments.

The above is a clinical trial exclusion criterion. Annotated with entity spans:
[Post-eligibility: Patients not willing to adhere to study procedures/treatments].